有關口周炎（perioral dermatitis）之敘述，下列何者錯誤？
A. 好發於女性
B. 應使用外用類固醇治療
C. 有時需要做細菌培養來排除金黃色葡萄球菌（S. aureus）感染的可能
D. 若給與口服doxycycline治療，應提醒病人防曬以免光致敏（photosensitization）

正確答案：B. 應使用外用類固醇治療